下列那條動脈與內腸骨動脈（internal iliac artery）無關？
A. 股骨動脈（femoral artery）
B. 子宮動脈（uterine artery）
C. 臍動脈（umbilical artery）
D. 中膀胱動脈（middle vesical artery）

正確答案：A. 股骨動脈（femoral artery）